Clinical trial inclusion criterion:
For patients: Burn injury exceeding 6-8 Total Burned Surface Area %

Annotated entities:
- Person: "patients"
- Condition: "Burn injury"
- Value: "exceeding 6-8 %"
- Measurement: "Total Burned Surface Area"